Have a planned surgical procedure or clinical situation that would allow objective neuromuscular monitoring techniques to be applied with access to the arm for neuromuscular transmission monitoring.

The above is a clinical trial inclusion criterion. Annotated with entity spans:
Have a [Mood: planned] [Procedure: surgical procedure] or [Condition: clinical situation] [Qualifier: that would allow objective neuromuscular monitoring techniques to be applied] with access to the arm for neuromuscular transmission monitoring.